Clinical trial exclusion criterion:
Family history of congenital or hereditary immunodeficiency.

Annotated entities:
- Observation: "Family history"
- Condition: "hereditary immunodeficiency"
- Condition: "congenital immunodeficiency"